健康婦女的陰道最常見的 normal flora 為何？
A. Bacteroides
B. Staphylococcus aureus
C. Lactobacilli
D. Garderella vaginalis

正確答案：C. Lactobacilli